下列關於子宮頸癌的敘述，何者正確？
A. 現行子宮頸癌分期採手術分期，手術是主要治療方式
B. 現行子宮頸癌分期採臨床分期，治療方法依期別的不同而有不同的選擇
C. 根除性子宮切除（Radical hysterectomy）是治療子宮頸癌的唯一方法
D. 子宮頸癌對放射線治療的反應差，所以不考慮放射線治療

正確答案：B. 現行子宮頸癌分期採臨床分期，治療方法依期別的不同而有不同的選擇